Patients with azathioprine or biologics therapy

The above is a clinical trial exclusion criterion. Annotated with entity spans:
Patients with [Drug: azathioprine] or [Drug: biologics] [Procedure: therapy]